age less than 13 years at time of procedure

The above is a clinical trial exclusion criterion. Annotated with entity spans:
[Person: age] [Value: less than 13 years] [Temporal: at time of procedure]